Female subjects who are pregnant or breast-feeding or considering becoming pregnant during the study

The above is a clinical trial exclusion criterion. Annotated with entity spans:
[Pregnancy_considerations: Female subjects who are pregnant or breast-feeding or considering becoming pregnant during the study]